Clinical trial exclusion criterion:
Obesity (women with a body mass index >35 kg/m2 or men with a body mass index >42 kg/m2)

Entity relations:
- AND("body mass index", "women")
- Has_value("body mass index", ">35 kg/m2")
- AND("body mass index", "men")
- Has_value("body mass index", ">42 kg/m2")
- AND("Obesity", "body mass index")
- OR("body mass index", "body mass index")